Clinical trial exclusion criterion:
Evidence of gastrointestinal bleeding

Annotated entities:
- Condition: "gastrointestinal bleeding"
- Observation: "Evidence of"